Patient currently has no evidence of progressive disease, as determined by the investigator, following previous treatment with ruxolitinib

The above is a clinical trial inclusion criterion. Annotated with entity spans:
Patient currently has no evidence of [Condition: progressive disease], as determined by the investigator, following previous treatment with [Drug: ruxolitinib]